Fulfills NIH criteria for bariatric surgery

The above is a clinical trial inclusion criterion. Annotated with entity spans:
[Value: Fulfills] [Measurement: NIH criteria] for [Condition: bariatric surgery]